Clinical trial exclusion criterion:
on medication e.g. steroid, multivitamins, thiamine-containing vitamins, diuretic drugs

Annotated entities:
- Drug: "steroid"
- Drug: "multivitamins"
- Drug: "thiamine-containing vitamins"
- Drug: "diuretic drugs"